Para medir la presión de enclavamiento pulmonar (PEP) mediante un catéter en arteria pulmonar, es recomendable tener en cuenta que:
1. No es necesario inflar el balón.
2. El catéter siempre se ha de introducir con el balón inflado, pero a la mitad del volumen recomendado.
3. El volumen de inflado del balón es, normalmente, de 1,5 ml de aire.
4. El volumen de inflado del balón es, normalmente, de 3 ml de aire.
5. Hay que dejar el balón siempre inflado después de realizar las determinaciones de PEP.

Respuesta correcta: 3. El volumen de inflado del balón es, normalmente, de 1,5 ml de aire.